Clinical trial inclusion criterion:
Wearing off phenomenon

Annotated entities:
- Condition: "Wearing off phenomenon"